30歲女性主訴近半年來口乾眼乾越來越嚴重，即使每天喝很多水也無法改善，眼科醫師經過Schirmer's test 之後確認為乾眼症，轉介至風濕免疫科門診。下列何種處置比較恰當？
A. 直接使用高劑量類固醇治療
B. 直接使用Cyclophosphamide治療
C. 直接使用Rituximab治療
D. 先抽血檢	Anti-SSA/SSB抗體

正確答案：D. 先抽血檢	Anti-SSA/SSB抗體